Clinical trial exclusion criterion:
Having experienced severe allergies, trauma history and/or operation history within 3 months;

Annotated entities:
- Condition: "severe allergies"
- Condition: "trauma"
- Procedure: "operation"
- Temporal: "within 3 months"